Patients must have signed an informed consent document stating that they understand the investigational nature of the proposed treatment

The above is a clinical trial inclusion criterion. Annotated with entity spans:
Patients must have [Informed_consent: signed an informed consent document] stating that they understand the investigational nature of the proposed treatment